Documented LA thrombus on imaging

The above is a clinical trial exclusion criterion. Annotated with entity spans:
Documented [Condition: LA thrombus] on [Procedure: imaging]